Chronic pain syndrome defined as use of any analgesic medication on a daily or near-daily basis

The above is a clinical trial exclusion criterion. Annotated with entity spans:
[Condition: Chronic pain syndrome] defined as use of [Qualifier: any] [Drug: analgesic medication] [Multiplier: on a daily] or near-daily basis